History of statin intolerance with drug interaction to antiretroviral drugs.

The above is a clinical trial exclusion criterion. Annotated with entity spans:
History of [Drug: statin] [Condition: intolerance] with drug interaction to [Drug: antiretroviral drugs].